Clinical trial exclusion criterion:
Has received sorafenib or oxaliplatin-based chemotherapy within 14 days of first dose of study medication

Entity relations:
- Has_qualifier("chemotherapy", "sorafenib or oxaliplatin-based")
- Has_index("within 14 days", "first dose of study medication")
- Has_temporal("chemotherapy", "within 14 days")